Clinical trial inclusion criterion:
Diagnosed with TB by criteria per Brazilian Ministry of Health

Annotated entities:
- Condition: "TB"
- Qualifier: "criteria per Brazilian Ministry of Health"